El acceso de fármacos al Sistema Nervioso central está condicionado por la existencia de la barrera hematoencefálica (BHE) dicha barrera:
1. Aumenta su permeabilidad en caso de inflamación.
2. Es homogénea en todo el encéfalo.
3. Es atravesada libremente por los fármacos liposolubles.
4. Es máxima en la zona quimiorreceptora del gatillo.
5. Disminuye su permeabilidad en caso de inflamación.

Respuesta correcta: 1. Aumenta su permeabilidad en caso de inflamación.